For how long do Drosophila embryos use maternal genome mRNA?

Mitoses before interphase 14 run on maternal products, and occur in metasynchronous waves.